Clinical trial exclusion criterion:
Suspected or known gynecological malignancy.

Entity relations:
- Has_mood("gynecological malignancy", "Suspected")
- OR("Suspected", "known")